What is the effect of the direct interaction of Ikaros and Foxp1 in B-lymphocytes?

The effect of the direct interaction of Ikaros and Foxp1 in B-lymphocytesis is modulation of expression of the G protein-coupled receptor G2A.